衛氏肺吸蟲（Paragonimus westermani）的感染途徑為：
A. 生食含囊狀幼蟲（metacercaria）的淡水魚
B. 生食含囊狀幼蟲（metacercaria）的水生植物
C. 生食含囊狀幼蟲（metacercaria）的淡水螃蟹
D. 由尾動幼蟲（cercaria）鑽入皮膚感染

正確答案：C. 生食含囊狀幼蟲（metacercaria）的淡水螃蟹